Clinical trial exclusion criterion:
patients with heart, liver, or renal function impairment;presence of severe infections or cerebrovascular disease;

Annotated entities:
- Condition: "renal function impairment"
- Condition: "liver function impairment"
- Condition: "heart function impairment"
- Qualifier: "severe"
- Condition: "infections"
- Condition: "cerebrovascular disease"